Clinical trial exclusion criterion:
malignancy (except basal cell carcinoma) and/or chemotherapy within 1 year prior to screening; malignancy more than 1 year prior to screening must have been local and without metastasis and/or recurrence, and if treated with chemotherapy, without nervous system complications;

Annotated entities:
- Condition: "malignancy"
- Negation: "except"
- Condition: "basal cell carcinoma"
- Procedure: "chemotherapy"
- Temporal: "within 1 year prior to screening"
- Reference_point: "screening"
- Condition: "malignancy"
- Temporal: "more than 1 year"
- Qualifier: "local"
- Negation: "without"
- Condition: "metastasis"
- Condition: "recurrence"